Clinical trial exclusion criterion:
angioneurotic edema in medical history (hereditary / idiopathic or associated with prior treatment with ACE inhibitors)

Entity relations:
- Has_temporal("treatment", "prior")
- AND("treatment", "ACE inhibitors")
- AND("associated", "treatment")
- Has_qualifier("angioneurotic edema", "hereditary")
- OR("hereditary", "associated", "idiopathic")